age>18 years

The above is a clinical trial inclusion criterion. Annotated with entity spans:
[Person: age][Value: >18 years]